Prolonged use (more than 14 days) immunosuppressants or other immunosuppressive drugs within 6 months prior to the start of the study;

The above is a clinical trial exclusion criterion. Annotated with entity spans:
[Temporal: Prolonged use] ([Temporal: more than 14 days]) [Drug: immunosuppressants] or [Qualifier: other] [Drug: immunosuppressive drugs] [Temporal: within 6 months prior to the start of the study];